Diagnosis of MS according to the McDonald criteria 2010 and cranial MRI scan demonstrating white matter lesions attributable to MS within 10 years before Screening

The above is a clinical trial inclusion criterion. Annotated with entity spans:
Diagnosis of [Condition: MS] according to the [Measurement: McDonald criteria 2010] and [Procedure: cranial MRI scan] demonstrating white matter lesions attributable to MS [Temporal: within 10 years before Screening]